下列關於惡性黑色素細胞癌（malignant melanoma）的敘述，何者正確？
A. 西方病患惡性黑色素細胞癌的基因突變最多的是NRAS突變
B. 東方病患惡性黑色素細胞癌的型態最常見的是肢端小痣（acral lentiginous）型
C. 惡性黑色素細胞癌的初級預防是教育、篩檢、早期偵測
D. 轉移惡性黑色素細胞癌的藥物治療只有標靶治療有效

正確答案：B. 東方病患惡性黑色素細胞癌的型態最常見的是肢端小痣（acral lentiginous）型